¿Cuál es, según el psicoanálisis, el mecanismo de defensa consistente en sustituir el verdadero deseo de la persona que provoca ansiedad por otro que no la provoque?:
1. Proyección.
2. Racionalización.
3. Represión.
4. Desplazamiento.

Respuesta correcta: 4. Desplazamiento.